Clinical trial exclusion criterion:
Hemoglobin < 11.5 g/dL for females and < 12.5 g/dL for men at screening.

Entity relations:
- Has_value("females", "< 11.5 g/dL")
- Has_value("men", "< 12.5 g/dL")
- AND("Hemoglobin", "females")
- Has_temporal("Hemoglobin", "at screening")
- OR("females", "men")